脫落性間質肺炎（desquamative interstitial pneumonia）病人肺泡內大量含有色素顆粒的細胞為：
A. 中性白血球
B. 脫落之上皮細胞
C. 巨噬細胞
D. 活化之淋巴母細胞

正確答案：C. 巨噬細胞